La hipertensión pulmonar se produce como consecuencia de la:
1. Broncoconstricción e inflamación de las vías respiratorias altas.
2. Broncoconstricción e inflamación de las vías respiratorias bajas.
3. Bronquiectasia y el colapso pulmonar.
4. Vasoconstricción de las arteriolas de la circulación sistémica.
5. Vasoconstricción de las arteriolas de la circulación pulmonar.

Respuesta correcta: 5. Vasoconstricción de las arteriolas de la circulación pulmonar.